關於泌乳素（prolactin）之分泌，下列何者正確？
A. 無日夜（diurnal）差別
B. 月經週期無差別
C. 呈脈衝型（pulsatile）
D. 呈平原型

正確答案：C. 呈脈衝型（pulsatile）